Patients with an expected life expectancy <48 hours

The above is a clinical trial exclusion criterion. Annotated with entity spans:
Patients with an [Observation: expected life expectancy] [Value: <48 hours]